17 歲男性由父母親陪伴入急診，主訴為一天前開始腹痛，伴隨有噁心的感覺，排便正常。病人覺得最近二週來很容易口渴，排尿次數增加，體重明顯減輕，有點呼吸急促。無任何過去病史。身體檢查發現病人身上有點水果味，血壓為 105/60 mmHg，心跳為 110/min，呼吸速率為 25/min，體溫為 36.7℃，腹部腸音正常，無明顯壓痛（tenderness）。血液白血球為 13500/μL，血色素為 16.6 g/dL，BUN/Creatinine 為 35/1.1 mg/dL，血糖為 310 mg/dL，C-reactive protein（CRP）為 0.05 mg/dL。 依此病人的臨床表現，你認為以下何種疾病最有可能？
A. 急性闌尾炎（acute appendicitis）
B. 消化性潰瘍（peptic ulcer disease）
C. 急性胃炎（acute gastritis）
D. 糖尿病酮酸血症（diabetic ketoacidosis）

正確答案：D. 糖尿病酮酸血症（diabetic ketoacidosis）